下列有關生長激素（growth hormone）的作用，何者正確？
A. 降低肝臟產生葡萄糖
B. 降低血中游離脂肪酸濃度
C. 增加骨骼肌對葡萄糖的攝取（uptake）
D. 血中生長激素濃度過高可能造成胰島素阻抗（insulin resistance）現象

正確答案：D. 血中生長激素濃度過高可能造成胰島素阻抗（insulin resistance）現象